Clinical trial inclusion criterion:
French Native language

Annotated entities:
- Observation: "French Native language"